一位中風病患，理解能力完全正常，講話時啟動困難，且需費力才能講出，講話語暢不順（dysprosody），同樣的字詞構音錯誤不一致（articulatory inconsistency），但會自我糾正。此位病患最可能為下列何種語言障礙？
A. 渥尼克失語症（Wernicke's aphasia）
B. 布洛克失語症（Broca's aphasia）
C. 構音障礙（articulation disorder）
D. 語言失用症（apraxia of speech）

正確答案：D. 語言失用症（apraxia of speech）